Clinical trial exclusion criteria:
Pregnant and/or nursing mothers.
Allergy to bupivacaine.
History of drug/alcohol abuse.
Severe cardiovascular, hepatic, renal disease or neurological impairment.

Annotated entities:
- Condition: "Pregnant"
- Condition: "nursing"
- Condition: "Allergy"
- Drug: "bupivacaine"
- Condition: "drug/alcohol abuse"
- Temporal: "History"
- Condition: "disease cardiovascular"
- Condition: "hepatic disease"
- Condition: "renal disease"
- Condition: "neurological impairment"